Clinical trial exclusion criterion:
Dementia or otherwise impaired cognition

Annotated entities:
- Condition: "Dementia"
- Condition: "impaired cognition"